Señale cuál de las siguientes opciones NO es una de las relaciones proposicionales propuestas por la Dra. Hernández Conesa para el estudio de la disciplina enfermera:
1. Persona-Salud.
2. Persona-Entorno.
3. Salud-Cuidados.
4. Persona-Enfermería.

Respuesta correcta: 4. Persona-Enfermería.